What is needed for MMP proteins to be functional?

Extracellular matrix metalloproteinases (MMPs) are a family of zinc-dependent neutral endopeptidases.